Clinical trial inclusion criterion:
Current use of standard antidepressant treatment in monotherapy or combination of 2 antidepressants : escitalopram (10 - 20mg/d), fluoxetine(20 - 40mg/d), paroxetine CR(25 - 50mg/d), sertraline(100 - 150mg/d), mirtazapine (15 - 45mg/d), duloxetine (30 - 60mg/d) or venlafaxine ER(150-225mg/d)

Annotated entities:
- Qualifier: "standard"
- Drug: "antidepressant"
- Qualifier: "monotherapy"
- Multiplier: "2"
- Drug: "antidepressants"
- Drug: "escitalopram"
- Drug: "fluoxetine"
- Drug: "paroxetine CR"
- Drug: "sertraline"
- Drug: "mirtazapine"
- Drug: "duloxetine"
- Multiplier: "10 - 20mg/d"
- Multiplier: "20 - 40mg/d"
- Multiplier: "25 - 50mg/d"
- Multiplier: "100 - 150mg/d"
- Multiplier: "15 - 45mg/d"
- Multiplier: "30 - 60mg/d"
- Drug: "venlafaxine ER"
- Multiplier: "150-225mg/d"